9個月大的女嬰，發燒咳嗽2天，出現聲音沙啞、咳嗽聲音異常、呼吸費力，來急診就醫，醫師發現有明顯的喘鳴音（Stridor），下列何種處置最不合適？
A. 給與氧氣吸入治療
B. 給與吸入性腎上腺素治療
C. 給與類固醇治療
D. 給與抗生素注射治療

正確答案：D. 給與抗生素注射治療